Clinical trial exclusion criterion:
Calculated creatinine clearance < 30 mL/min by Cockcroft-Gault formula

Entity relations:
- AND("Calculated creatinine clearance", "Cockcroft-Gault formula")
- Has_value("Calculated creatinine clearance", "< 30 mL/min")